Una reacción en que una sola materia prima puede producir dos o más productos estereoisoméricos, pero produce uno de ellos en mayor cantidad que cualquier otro, se conoce como:
1. Enantioespecífica.
2. Estereoselectiva.
3. Diastereoespecífica.
4. Quiral.

Respuesta correcta: 2. Estereoselectiva.